Clinical trial inclusion criterion:
Age from 40 to 75 years

Annotated entities:
- Person: "Age"
- Value: "from 40 to 75 years"